Clinical trial inclusion criterion:
Unresectable (locally advanced) stage IIIa or IIIb disease

Entity relations:
- Subsumes("Unresectable", "locally advanced")
- Has_qualifier("stage IIIa disease", "Unresectable")
- OR("stage IIIa disease", "stage IIIb disease")